下列有關長期臥床缺乏運動可能出現的生理現象，何者為誤？
A. 關節攣縮
B. 肌力下降
C. 血鈣濃度下降
D. 姿態性低血壓

正確答案：C. 血鈣濃度下降